Clinical trial inclusion criterion:
Intracranial or cerebral haemorrhage

Annotated entities:
- Condition: "cerebral haemorrhage"
- Condition: "Intracranial haemorrhage"